¿Qué caracteriza al trastorno disociativo de identidad?:
1. La confusión sobre la identidad personal o asunción de una nueva identidad.
2. Presencia de dos o más identidades distintas o estados de personalidad que controlan el comportamiento del individuo de modo recurrente.
3. Una amnesia selectiva.
4. Una experiencia persistente o recurrente de sentirse distanciado.
5. Una sensación de irrealidad.

Respuesta correcta: 2. Presencia de dos o más identidades distintas o estados de personalidad que controlan el comportamiento del individuo de modo recurrente.